Ethosuximide可抑制T型鈣離子通道，主要用於治療下列何種癲癇發作？
A. 全面強直陣攣發作（generalized tonic-clonic seizure）
B. 失神發作（absence seizure）
C. 部份發作（partial seizure）
D. 肌陣攣發作（myoclonic seizure）

正確答案：B. 失神發作（absence seizure）